下列那一類紫外線對人體傷害性最低？
A. UV-A
B. UV-B
C. UV-C
D. UV-D

正確答案：A. UV-A